Clinical trial inclusion criterion:
American Society of Anesthesiologists Classification I-III

Entity relations:
- Has_value("American Society of Anesthesiologists Classification", "I-III")